Clinical trial inclusion criterion:
Aged 5 years to less than 12 years at Visit 1. At least 15 (25%) children of the total study population must be aged 5 to less than 8 years.

Entity relations:
- Has_index("at Visit 1", "Visit 1")
- Has_value("Aged", "5 years to less than 12 years")
- Has_temporal("5 years to less than 12 years", "at Visit 1")